Clinical trial exclusion criterion:
Sever forms of peripheral arterial occlusive disease and Raynaud's syndrome.

Annotated entities:
- Condition: "peripheral arterial occlusive disease"
- Condition: "Raynaud's syndrome"
- Qualifier: "Sever"
- Non-query-able: "and"